El cumplimiento de un tratamiento por parte de un paciente:
1. Tiende a aumentar cuando se cuenta con una red social de apoyo.
2. Es bastante similar tanto cuando se realizan prescripciones simples como complejas.
3. Suele disminuir si este presenta características de personalidad como la extroversión y la obesidad.
4. Tiende a aumentar cuanto mayor es la gravedad de la enfermedad y menor la severidad de los efectos secundarios.

Respuesta correcta: 1. Tiende a aumentar cuando se cuenta con una red social de apoyo.